Reduced left ventricular ejection fraction (<50%)

The above is a clinical trial inclusion criterion. Annotated with entity spans:
[Value: Reduced] [Measurement: left ventricular ejection fraction] ([Value: <50%])